Clinical trial inclusion criterion:
6. Home environment safe and amenable to rest , availability of family support such as a sister or mother who will help the patient at home .

Annotated entities:
- Parsing_Error: "6."
- Non-query-able: "Home environment safe and amenable to rest , availability of family support such as a sister or mother who will help the patient at home ."
- Subjective_judgement: "Home environment safe and amenable to rest , availability of family support such as a sister or mother who will help the patient at home ."